黃先生今年 51 歲，一年來記憶力明顯減退，走路不穩，半夜起來上廁所常常跌倒。身體檢查（physical examination）發現黃先生兩腳無力，下肢肌腱反射（tendon reflex）下降，出現 Babinski sign；腳部對音叉的震動感消失，但針刺感則正常。黃先生沒有接觸任何化學溶劑，也沒有服用中藥，不過 5 年前接受胃切除手術。下列那一項檢查對診斷最有幫助？
A. 腦波檢查
B. 血中維他命 B12濃度檢查
C. 腦部造影檢查（CT 或 MRI）
D. 腦脊髓液檢查

正確答案：B. 血中維他命 B12濃度檢查